Clinical trial exclusion criterion:
expected to live under five years

Annotated entities:
- Observation: "expected to live"
- Value: "under five years"